下列血液凝固路徑（hemostatic pathway）中的成分因子，何者不具有抗血液凝固（anticoagulation）的作用？
A. tissue factor（TF）
B. protein C
C. protein S
D. antithrombin III

正確答案：A. tissue factor（TF）